La presencia de tubo digestivo con ciegos ramificados que se extienden hasta el extremo posterior del gusano adulto, es característica de la especie:
1. Fasciola hepática.
2. Fasciolopsis buski.
3. Dicrocoelium dentriticum.
4. Paragonimus westermani.
5. Clonorchis sinensis.

Respuesta correcta: 1. Fasciola hepática.